patient already treated by medicines which could interfere with the study

The above is a clinical trial exclusion criterion. Annotated with entity spans:
[Context_Error: patient already treated by medicines which could interfere with the study]